Clinical trial inclusion criteria:
Adult males and females who are 18 years of age or older.
Evidence or suspicion of upper gastrointestinal bleed (GIB)
Patient with known or suspected cirrhosis
Upper GIB secondary to bleeding esophageal varices as show by esophageal endoscopy, requiring endoscopic band ligation (EBL) at presentation
Willing and able to provide informed consent for study, or have a Legally authorized representative (LAR) provide consent if the patient is unable to do so

Annotated entities:
- Person: "Adult"
- Person: "males"
- Person: "females"
- Value: "18 years of age or older"
- Mood: "suspicion"
- Mood: "Evidence"
- Condition: "upper gastrointestinal bleed (GIB)"
- Mood: "suspected"
- Mood: "known"
- Condition: "cirrhosis"
- Condition: "Upper GIB"
- Qualifier: "secondary"
- Qualifier: "bleeding"
- Condition: "esophageal varices"
- Procedure: "esophageal endoscopy"
- Mood: "requiring"
- Procedure: "endoscopic band ligation (EBL)"
- Temporal: "at presentation"
- Informed_consent: "Willing and able to provide informed consent for study, or have a Legally authorized representative (LAR) provide consent if the patient is unable to do so"